Clinical trial exclusion criterion:
Patients on antibiotics.

Annotated entities:
- Drug: "antibiotics"